Clinical trial exclusion criteria:
Use of smoking cessation medications or interventions in last 30 days
Unstable medical illness that requires immediate medical care
AUDIT score of < 5 or > 26
Pregnancy or other Nicotine Replacement Therapy (NRT) contraindications
Current history or in past 6 months of psychotic disorder or major depressive disorders that is not stable on treatment for past 3 months
Cognitive impairment

Annotated entities:
- Procedure: "smoking cessation"
- Procedure: "medications"
- Procedure: "interventions"
- Temporal: "in last 30 days"
- Non-query-able: "Unstable medical illness that requires immediate medical care"
- Measurement: "AUDIT"
- Value: "score of < 5 or > 26"
- Condition: "Pregnancy"
- Condition: "contraindications"
- Procedure: "Nicotine Replacement Therapy"
- Procedure: "NRT"
- Condition: "psychotic disorder"
- Condition: "major depressive disorders"
- Qualifier: "not stable"
- Temporal: "for past 3 months"
- Temporal: "past 6 months"
- Condition: "Cognitive impairment"